Written informed consent signed by patient.

The above is a clinical trial inclusion criterion. Annotated with entity spans:
W[Post-eligibility: ritten informed consent signed by patient].